3. An ulcer which shows signs of severe clinical infection, defined as pus oozing from the ulcer site

The above is a clinical trial exclusion criterion. Annotated with entity spans:
[Parsing_Error: 3.] An [Condition: ulcer] which [Qualifier: shows signs of severe clinical infection], defined as [Condition: pus] oozing from the ulcer site